一位 2 歲大的男童，在晚餐過後，突然劇烈咳嗽、呼吸急促，開始出現喘鳴（stridor）情形，並有瞬間發紺（cyanosis）現象，在急診室會診耳鼻喉科之前初步應先安排下列那些檢查？①胸部 X 光 ②頸部 X 光 ③頭頸部電腦斷層 ④軟式喉氣管內視鏡
A. ②③
B. ①③
C. ①②
D. ③④

正確答案：C. ①②